Clinical trial inclusion criterion:
diagnosis of ADHD

Annotated entities:
- Condition: "ADHD"